Clinical trial exclusion criterion:
Patients with leg injury involving nerve damage

Annotated entities:
- Condition: "leg injury"
- Condition: "nerve damage"